Clinical trial exclusion criterion:
taking antibiotics or PPIs or bismuth salts within four weeks

Annotated entities:
- Drug: "antibiotics"
- Drug: "PPIs"
- Drug: "bismuth salts"
- Temporal: "within four weeks"